History of hypersensitivity or adverse reaction to local anesthetics, opioid, or any ingredient of the medications administered in this study.

The above is a clinical trial exclusion criterion. Annotated with entity spans:
History of [Condition: hypersensitivity] or [Condition: adverse reaction] to [Drug: local anesthetics], [Drug: opioid], or any [Drug: ingredient of the medications administered in this study].